有關葡萄球菌（Staphylococcus）引起的食物中毒的敘述，下列那一項錯誤？
A. 是由 heat-labile enterotoxin 引起
B. 症狀產生快，大約 4 小時內就會發生
C. 症狀消失快，大約 24 小時會消失
D. 有些 Staphylococcus aureus 菌種會導致 pseudomembranous enterocolitis

正確答案：A. 是由 heat-labile enterotoxin 引起